Clinical trial inclusion criteria:
Patients less than 16 years old with newly diagnosed PML-RARa positive acute promyelocytic leukemia.

Annotated entities:
- Value: "less than 16 years"
- Person: "old"
- Measurement: "PML-RARa"
- Value: "positive"
- Condition: "acute promyelocytic leukemia"